List R packages for lipidomics

R packages for lipidomics include: lipidr, masspix, lipidms, lipidr and lipid mini-on.